Hospitalization with acute undifferentiated fever (temperature > 37.5 C, tympanic) =14 days or patients admitted to hospital with a history of fever = 14 days who subsequently develop fever within 24 hours of admission

The above is a clinical trial inclusion criterion. Annotated with entity spans:
[Procedure: Hospitalization] with [Condition: acute undifferentiated fever] ([Measurement: temperature] [Value: > 37.5 C], [Condition: tympanic]) [Multiplier: =14 days] or patients [Procedure: admitted to hospital] with a [Temporal: history] of [Condition: fever] [Multiplier: = 14 days] who subsequently develop [Condition: fever] [Temporal: within 24 hours of admission]